En HPLC (Cromatografía de líquidos de alta eficacia) se utilizan empaquetamientos con un intervalo de tamaño o diámetro de partícula típicos de:
1. 3-10 Amstroms.
2. 3-10 Nanómetros.
3. 3-10 Milímetros.
4. 3-10 Micrómetros.
5. 3-10 Centímetros.

Respuesta correcta: 4. 3-10 Micrómetros.